15. Concomitant administration of any prescription or over the counter medications known to be highly dependent on P450 or P-gp for clearance for which elevated plasma concentrations are known to be associated with serious toxicity

The above is a clinical trial exclusion criterion. Annotated with entity spans:
[Parsing_Error: 15.] [Temporal: Concomitant] administration of any prescription or over the counter [Undefined_semantics: medications known to be highly dependent on P450 or P-gp for clearance] for which [Value: elevated] [Measurement: plasma concentrations] are known to be associated with [Qualifier: serious] [Condition: toxicity]